Clinical trial exclusion criterion:
Severe extrahepatic diseases: cardiovascular, respiratory, cerebrovascular and poorly controlled diabetes.

Entity relations:
- Has_qualifier("extrahepatic diseases", "Severe")
- Has_qualifier("diabetes", "poorly controlled")
- Subsumes("extrahepatic diseases", "cardiovascular")
- Subsumes("extrahepatic diseases", "and")
- OR("cardiovascular", "respiratory", "cerebrovascular", "diabetes")